Clinical trial inclusion criterion:
at modified Hoehn and Yahr (H&Y) stage 1.5 to 3 (Hoehn and Yahr ,1967; Goetz et al., 2004);

Annotated entities:
- Measurement: "modified Hoehn and Yahr (H&Y)"
- Value: "stage 1.5 to 3"